Clinical trial inclusion criterion:
ECOG performance status =2.

Entity relations:
- Has_value("ECOG performance status", "=2")